Clinical trial exclusion criterion:
Hypertension (high blood pressure) that can not be controlled by drugs;

Annotated entities:
- Condition: "Hypertension"
- Condition: "high blood pressure"
- Qualifier: "controlled by drugs"
- Drug: "drugs"
- Negation: "not"